Clinical trial exclusion criterion:
Allergy or sensitivity to corticosteroids or any drug hypersensitivity or intolerance that would compromise patient safety or study results

Annotated entities:
- Qualifier: "corticosteroids"
- Condition: "drug hypersensitivity"
- Condition: "drug intolerance"
- Condition: "Allergy"
- Condition: "sensitivity"
- Subjective_judgement: "hat would compromise patient safety or study results"
- Drug: "corticosteroids"